Clinical trial inclusion criteria:
Women above 18 years of age with biopsy proven, clinically stage 1 or 2 breast cancer who will be undergoing partial mastectomy with SLNBx at Memorial Health

Annotated entities:
- Person: "Women"
- Value: "above 18 years"
- Person: "age"
- Condition: "breast cancer"
- Qualifier: "stage 1"
- Qualifier: "stage 2"
- Procedure: "biopsy"
- Procedure: "partial mastectomy"
- Procedure: "SLNBx"
- Visit: "at Memorial Health"
- Mood: "will be undergoing"